由 basal ganglia 輸出至 thalamus 的訊息主要由何者媒介？
A. GABA
B. acetylcholine
C. glutamate
D. dopamine

正確答案：A. GABA